Clinical trial inclusion criterion:
INR known to be greater than 1.5 at the time of screening

Annotated entities:
- Measurement: "INR"
- Value: "greater than 1.5"
- Temporal: "at the time of screening"
- Reference_point: "the time of screening"